Clinical trial exclusion criterion:
8. intent to use NSAIDs or steroids

Annotated entities:
- Drug: "NSAIDs"
- Drug: "steroids"